Un hombre de 80 años es llevado a urgencias por la policía al encontrarle por la noche, en la calle, a varios bloques de su domicilio, algo perdido. Dice al médico de urgencias “me encuentro bien, estaba paseando y me he perdido”. La revisión por sistemas, es anodina. Al preguntarle por medicaciones, no recuerda. En su historial constan glipizida, atenolol y acenocumarol. Ha estado 3 veces en urgencias en los últimos 3 meses por “mareo”, dolor lumbar y un INR de 5,0. Refiere independencia en las actividades básicas e instrumentales de la vida diaria. No hay evidencia de familiares o amigos cercanos. Varias referencias del trabajo social del área indican que rechaza ayudas o visitas médicas o de enfermería. En la exploración física, únicamente destaca temperatura de 37,7ºC, IMC de 16 Kg/m2, PA 160/90 mmHg, frecuencia cardiaca 90 lpm y saturación de oxígeno de 99%. Tiene pérdida global de masa muscular. Está vestido con la bata de casa y huele a orina. Rechaza contestar a las preguntas del Mini-Mental. En las pruebas de laboratorio destacan leucocitos 13.000/microL, glucemia 300 mg/dL, hemoglobina A1c 11%, INR 0,9. Orina: más de 50 leucocitos/campo y nitritos +. Urocultivo: >100.000 colonias de bacilos gram-negativos. Es ingresado en el hospital, recibe antibióticos, insulina y se reinicia acenocumarol con buena evolución. Está estable y quiere irse a su domicilio. La enfermera de planta refiere que es incapaz de autoadministrarse la insulina. ¿Cuál de los siguientes es el próximo paso para determinar la seguridad del paciente en su domicilio?
1. Referir a Atención Primaria y trabajo social del área para determinar la seguridad en el domicilio.
2. Evaluación formal de la capacidad para tomar decisiones concernientes a su salud.
3. Evaluación para descartar demencia.
4. Evaluación para descartar depresión.

Respuesta correcta: 2. Evaluación formal de la capacidad para tomar decisiones concernientes a su salud.